原發性顫抖（essential tremor）之手術目標以下列何者為主？
A. 視丘（thalamus）
B. 下視丘（subthalamus）
C. 蒼白球（globus pallidus）
D. 大腦皮質（cerebral cortex）

正確答案：A. 視丘（thalamus）